Clinical trial exclusion criterion:
Oral corticosteroids at a dose >40 mg prednisone or its equivalent per day; receipt of cyclosporine, tacrolimus, sirolimus, or mycophenolate mofetil within 8 weeks before the first study agent injection; or use of an investigational agent within 5 half-lives of that agent before the first study agent injection.

Annotated entities:
- Drug: "Oral corticosteroids"
- Multiplier: ">40 mg prednisone per day"
- Drug: "cyclosporine"
- Drug: "tacrolimus"
- Drug: "sirolimus"
- Drug: "mycophenolate mofetil"
- Temporal: "within 8 weeks before the first study agent injection"
- Drug: "investigational agent"
- Temporal: "within 5 half-lives"
- Temporal: "before the first study agent injection"